In good general health, without significant medical history, physical examination findings, or clinical laboratory abnormalities.

The above is a clinical trial inclusion criterion. Annotated with entity spans:
[Undefined_semantics: In good general health, without significant medical history, physical examination findings, or clinical laboratory abnormalities.]